What is the basis of the methodology of "functional class scoring" (FCS) for the analysis of gene expression data?

Functional class scoring (FCS), examines the statistical distribution of individual gene scores among all genes in the gene ontology class and does not involve an initial gene selection step. It consists of a semi-supervised method exploring both the expression pattern and the functional annotation of the genes.